Clinical trial inclusion criterion:
Patient has intraocular pressure (IOP) ≤ 20 mmHg.

Annotated entities:
- Measurement: "intraocular pressure (IOP)"
- Value: "≤ 20 mmHg"